Patients who have been previously treated with radioactive directed therapies

The above is a clinical trial exclusion criterion. Annotated with entity spans:
Patients who have been [Temporal: previously] treated with [Procedure: radioactive directed therapies]